Clinical trial exclusion criterion:
contra-indications for medical induction of labor

Entity relations:
- AND("contra-indications", "medical induction of labor")